一般婦科手術後，最常見的術後感染部位是：
A. lung
B. vaginal cuff
C. incision wound
D. urinary tract

正確答案：D. urinary tract